Clinical trial inclusion criterion:
BMI 25.0 - 45.0 kg/m2

Entity relations:
- Has_value("BMI", "25.0 - 45.0 kg/m2")